Una de las funciones de los carbohidratos es:
1. La absorción.
2. La energética.
3. La contracción muscular.
4. El almacenamiento.

Respuesta correcta: 2. La energética.